Clinical trial exclusion criteria:
known allergy to any of drugs used
coagulopathy
any wound or infection related to puncture site
major illness
failure to gain consent of parents.

Annotated entities:
- Condition: "allergy"
- Drug: "drugs used"
- Condition: "coagulopathy"
- Condition: "wound"
- Condition: "infection"
- Qualifier: "puncture site"
- Qualifier: "major"
- Condition: "illness"
- Observation: "consent of parents"
- Negation: "failure to gain"
- Informed_consent: "failure to gain consent of parents"